Contraindication for propofol administration

The above is a clinical trial exclusion criterion. Annotated with entity spans:
[Condition: Contraindication] for [Drug: propofol] administration